La vía óptica decusa parcialmente en:
1. La cintilla óptica.
2. El cuerpo geniculado.
3. El quiasma óptico.
4. La retina.
5. El disco óptico.

Respuesta correcta: 3. El quiasma óptico.